Clinical trial exclusion criterion:
1. History of colorectal surgery

Entity relations:
- Has_temporal("colorectal surgery", "History")